下列有關丘腦下核（subthalamic nucleus）之敘述，何者錯誤？
A. 參與基底核迴路中的 indirect loop
B. 丘腦下核損傷可能導致不自主運動（involuntary movement）
C. 丘腦下核位於中腦
D. 丘腦下核的神經元使用興奮性神經傳遞物質

正確答案：C. 丘腦下核位於中腦